Alpha-1-Antitrypsin Deficiency

The above is a clinical trial exclusion criterion. Annotated with entity spans:
[Condition: Alpha-1-Antitrypsin Deficiency]